Flumazenil 是下列何種麻醉藥物的拮抗劑（Antagonist）？
A. Ketamine
B. Midazolam
C. Propofol
D. Thiopental

正確答案：B. Midazolam